下列那個測量值較不易受到資料極端值的影響？
A. 平均值
B. 中位數
C. 全距
D. 標準差

正確答案：B. 中位數